Participation in an investigational drug or device study within 90 days prior to screening, as calculated from the follow-up from the previous study

The above is a clinical trial exclusion criterion. Annotated with entity spans:
[Context_Error: Participation in an investigational drug or device study within 90 days prior to screening, as calculated from the follow-up from the previous study]